2. hypertriglyceridemia (triglyceride levels of 150 mg⁄dL or greater);

The above is a clinical trial inclusion criterion. Annotated with entity spans:
2. [Condition: hypertriglyceridemia] ([Measurement: triglyceride levels] of [Value: 150 mg⁄dL or greater]);